48歲婦女，做抹片檢查，報告為high-grade squamous intraepithelial lesion（HSIL），下一步處置何者最適當？
A. 半年抹片追蹤一次
B. 考慮HPV檢查並施打HPV疫苗
C. 建議陰道鏡下切片檢查
D. 安排fractional D&C檢查

正確答案：C. 建議陰道鏡下切片檢查